Clinical trial exclusion criterion:
Malignancy including leukemia and lymphoma within the last 5y.

Entity relations:
- Subsumes("Malignancy", "leukemia")
- Has_temporal("Malignancy", "within the last 5y")
- OR("leukemia", "lymphoma")